Which is the substrate of the haspin kinase during mitosis?

Haspin phosphorylates histone H3 at Thr3 (H3T3ph) during mitosis